下列有關肺隔離（pulmonary sequestration）之敘述，何者錯誤？
A. 肺組織與氣道系統無正常聯結
B. 血流供應來自肺動脈
C. 肺葉外肺隔離常合併其他先天異常
D. 肺葉內肺隔離常合併感染

正確答案：B. 血流供應來自肺動脈